國際衛生組織（WHO）對於殘障的定義與分類中，生活不便且無法在社會中扮演一個充實的角色 （inability to fulfill role）者，歸類為：
A. impairment
B. disability
C. barrier
D. handicap

正確答案：D. handicap